一位 12 歲男童因為身材矮小就診，他出生時體重 3.5 公斤，最近一年身高增加 4 公分。他的父親身高 160 公分，第二性徵發育始於 14 歲；母親身高 150 公分，初經年齡為 13 歲。此男童身體診查顯示身高 131 公分（低於第三百分位），體重 27.5 公斤（第十百分位），左右睪丸均為 4 毫升，無陰毛發育，此外未發現其他身體檢查異常。骨齡檢查結果為 11 歲 6 個月，血清 IGF-I 值為 200 ng/mL （正常值 140-400 ng/mL）。此男童最可能的診斷為：
A. 家族性身材矮小（familial short stature）
B. 腦垂體低能症（hypopituitarism）
C. 體質性生長遲緩（constitutional growth delay）
D. 營養不良（malnutrition）

正確答案：A. 家族性身材矮小（familial short stature）